Participation in drug or devices investigative clinical trials in the last 30 days;

The above is a clinical trial exclusion criterion. Annotated with entity spans:
[Non-query-able: Participation in drug or devices investigative clinical trials in the last 30 days;]